inclusion in other randomized studies

The above is a clinical trial exclusion criterion. Annotated with entity spans:
[Competing_trial: inclusion in other randomized studies]